8. Have participated in the study before.

The above is a clinical trial exclusion criterion. Annotated with entity spans:
[Parsing_Error: 8.] Have participated in the study before.